Women with multi-fetal pregnancy, diabetes mellitus, chronic hypertension, or chronic renal disease

The above is a clinical trial exclusion criterion. Annotated with entity spans:
[Person: Women] with [Condition: multi-fetal pregnancy], [Condition: diabetes mellitus], [Condition: chronic hypertension], or [Condition: chronic renal disease]